Clinical trial exclusion criterion:
Unstable patient

Entity relations:
- Has_qualifier("patient", "Unstable")